Patient presents with acute coronary syndrome (ACS) or stable coronary artery disease (CAD)

The above is a clinical trial inclusion criterion. Annotated with entity spans:
Patient presents with [Condition: acute coronary syndrome] ([Condition: ACS]) or [Qualifier: stable] [Condition: coronary artery disease] ([Condition: CAD])